The subject or any of their healthcare providers is aware of the subjects HLA type.

The above is a clinical trial exclusion criterion. Annotated with entity spans:
[Non-query-able: The subject or any of their healthcare providers is aware of the subjects HLA type].